下列何者與小隱靜脈（small saphenous vein）伴行？
A. 隱神經（saphenous nerve）
B. 腓腸神經（sural nerve）
C. 腓深神經（deep peroneal nerve）
D. 腓淺神經（superficial peroneal nerve）

正確答案：B. 腓腸神經（sural nerve）